一位 30 歲的男性因不孕症求診，其精液分析結果如下：pH 8.5，total volume 5 c.c.，sperm count 0，醫師遂為其安排睪丸切片（testis biopsy）檢查，其病理化驗結果可見精細胞（spermatid），但沒有發現精蟲（sperm）。下列何診斷最佳？
A. obstructive azoospermia
B. maturation arrest
C. hypospermatogenesis
D. Sertoli-cell-only syndrome

正確答案：B. maturation arrest